小青患有憂鬱症，近來心情不好服下 50 顆的百憂解（Prozac）。下列何者不是百憂解過量，所產生典型 的 serotonin syndrome 症狀？
A. 躁動不安（agitation）
B. 心跳減慢
C. 血壓升高
D. 肌肉僵硬（muscular rigidity）

正確答案：B. 心跳減慢